El signo de Rovsing característico en las apendicitis aguda consiste en:
1. Dolor a la presión en epigastrio al aplicar una presión firme y persistente sobre el punto de McBurney.
2. Dolor agudo que aparece al comprimir el apéndice entre la pared abdominal y la cresta ilíaca.
3. Sensibilidad de rebote pasajera en la pared abdominal.
4. Pérdida de la sensibilidad abdominal al contraer los músculos de la pared abdominal.
5. Dolor en el punto de McBurney al comprimir el cuadrante inferior izquierdo del abdomen.

Respuesta correcta: 5. Dolor en el punto de McBurney al comprimir el cuadrante inferior izquierdo del abdomen.